Clinical trial inclusion criterion:
Advanced hormone-dependent prostate cancer for which androgen deprivation therapy is indicated, and independently from this trial, Firmagon® is intended to be used for treatment

Annotated entities:
- Qualifier: "hormone-dependent"
- Qualifier: "Advanced"
- Condition: "prostate cancer"
- Procedure: "androgen deprivation therapy"
- Drug: "Firmagon"
- Mood: "intended"